Left bundle branch block or ventricular pacing

The above is a clinical trial exclusion criterion. Annotated with entity spans:
[Condition: Left bundle branch block] or [Condition: ventricular pacing]